Severe gastroesophageal reflux

The above is a clinical trial exclusion criterion. Annotated with entity spans:
[Qualifier: Severe] [Condition: gastroesophageal reflux]